Clinical trial exclusion criteria:
HbA1c greater than 75 mmol/mol (9.0%)
Child unwilling to agree to second insulin injection at a meal-time
Untreated coeliac disease or other concomitant condition likely to affect BG control
Food allergies (other than controlled Coeliac Disease)
Vegetarians, vegans or patients with religious dietary restrictions (as the standard meal contains meat)
Participant taking any glucose-containing medication concurrently

Annotated entities:
- Measurement: "HbA1c"
- Value: "greater than 75 mmol/mol"
- Value: "9.0%"
- Post-eligibility: "Child unwilling to agree to second insulin injection at a meal-time"
- Condition: "coeliac disease"
- Qualifier: "Untreated"
- Condition: "Food allergies"
- Negation: "other"
- Condition: "Coeliac Disease"
- Person: "Vegetarians"
- Procedure: "glucose-containing medication"